Written informed consent obtained

The above is a clinical trial inclusion criterion. Annotated with entity spans:
[Informed_consent: Written informed consent obtained]